Clinical trial exclusion criterion:
Have a history of myocardial infarction in the past 6 months

Annotated entities:
- Condition: "myocardial infarction i"
- Temporal: "past 6 months"